Clinical trial exclusion criterion:
inadequate spoken finnish for reliable pain assessment

Annotated entities:
- Observation: "inadequate spoken finnish"
- Procedure: "reliable pain assessment"